Treatment with Ticagrelor within 48 hours

The above is a clinical trial inclusion criterion. Annotated with entity spans:
[Procedure: Treatment] with [Drug: Ticagrelor] [Temporal: within 48 hours]